Viral load ≥10000UI/mL.

The above is a clinical trial inclusion criterion. Annotated with entity spans:
[Measurement: Viral load] [Value: ≥10000UI/mL].